Clinical trial exclusion criterion:
Administration of immunoglobulins and/or any blood products since birth or planned administration during the active phase of the study.

Entity relations:
- Has_temporal("planned", "during the active phase of the study")
- Has_temporal("immunoglobulins", "since birth")
- Has_index("during the active phase of the study", "active phase of the study")
- Has_index("since birth", "birth")
- OR("immunoglobulins", "any blood products")
- OR("since birth", "planned")